Had unprotected sexual intercourse within 30 days before study entry and who do not agree to use a highly effective method of contraception (eg, total abstinence, an intrauterine device, a double-barrier method [such as condom plus diaphragm with spermicide], a contraceptive implant, an oral contraceptive, or have a vasectomized partner with confirmed azoospermia) throughout the entire study period and for 28 days after study drug discontinuation

The above is a clinical trial exclusion criterion. Annotated with entity spans:
Had [Condition: unprotected sexual intercourse] [Temporal: within 30 days before study entry] and who [Observation: do not agree] to use a [Qualifier: highly effective] [Observation: method of contraception] (eg, [Value: total] [Measurement: abstinence], an [Device: intrauterine device], a [Observation: double-barrier method] [such as [Device: condom] plus [Device: diaphragm with spermicide]], a [Device: contraceptive implant], an [Drug: oral contraceptive], or have a [Procedure: vasectomized] [Person: partner] with confirmed [Condition: azoospermia]) [Temporal: throughout the entire study period] and [Temporal: for 28 days after study drug discontinuation]